An initial plasma potassium concentration of lower than 3.0 mmol/L

The above is a clinical trial exclusion criterion. Annotated with entity spans:
An [Multiplier: initial] [Measurement: plasma potassium concentration] of [Value: lower than 3.0 mmol/L]